En los trastornos relacionados con el consumo de sustancias, ¿en qué consiste la dependencia física?
1. En un proceso físico de corta duración.
2. En una intensa sensación de insatisfacción por no poder consumir las sustancias.
3. En la acción de consumir las drogas produciendo un estado de intoxicación con efecto psicoactivo.
4. En una serie de cambios físicos y psíquicos que tienen lugar tras la administración de una sustancia.
5. En un estado de adaptación física manifestada por intensos trastornos físicos cuando se interrumpe la administración de la droga.

Respuesta correcta: 5. En un estado de adaptación física manifestada por intensos trastornos físicos cuando se interrumpe la administración de la droga.